Para que un fármaco pueda permear a través de la cornea debe:
1. Estar totalmente ionizado.
2. Presentar una polaridad muy elevada.
3. Unirse a la lisozima que está presente en el fluido lagrimal.
4. Presentar una cierta lipofilia y un mínimo grado de hidrosolubilidad.
5. Tener carácter ácido débil.

Respuesta correcta: 4. Presentar una cierta lipofilia y un mínimo grado de hidrosolubilidad.